Clinical trial exclusion criterion:
Chronic HBV/HIV infection

Annotated entities:
- Condition: "infection Chronic HBV"
- Condition: "HIV infection Chronic"